Clinical trial inclusion criterion:
1. Fasting glucose > 7.0 or have diabetes medication;

Annotated entities:
- Measurement: "Fasting glucose"
- Value: "> 7.0"
- Drug: "diabetes medication"
- Condition: "diabetes"
- Undefined_semantics: "diabetes medication"